Clinical trial exclusion criterion:
Known furosemide hypersensitivity.

Annotated entities:
- Drug: "furosemide"
- Condition: "hypersensitivity"